Clinical trial exclusion criterion:
Patients who have a history of psychotropics abuse and can not quit, or who have mental disorders;

Annotated entities:
- Temporal: "history"
- Condition: "abuse"
- Drug: "psychotropics"
- Condition: "mental disorders"
- Non-representable: "and can not quit"